moderate or severe hepatic dysfunction (Child Pugh B or C)

The above is a clinical trial inclusion criterion. Annotated with entity spans:
[Qualifier: moderate] or [Qualifier: severe] [Condition: hepatic dysfunction] ([Measurement: Child Pugh] [Value: B or C])